右肺門的肺動脈位在支氣管的：
A. 上方
B. 下方
C. 前方
D. 後方

正確答案：C. 前方